La exposición a andrógenos en un período sensible o crítico, al inicio del desarrollo, provoca masculinización de los órganos sexuales y del comportamiento. Este efecto ha recibido el nombre de:
1. Efecto motivacional.
2. Efecto de las feromonas.
3. Efecto activador.
4. Efecto organizador.
5. Efecto biológico.

Respuesta correcta: 4. Efecto organizador.